Suspected or documented tuberculosis involving the central nervous system and/or bones and/or joints, and/or miliary tuberculosis and/or pericardial tuberculosis.

The above is a clinical trial exclusion criterion. Annotated with entity spans:
[Mood: Suspected] or [Mood: documented] [Condition: tuberculosis] involving the [Qualifier: central nervous system] and/or [Qualifier: bones] and/or [Qualifier: joints], and/or [Qualifier: miliary tuberculosis] and/or [Qualifier: pericardial tuberculosis].